目前國際醫療正流行，希望能吸引外國人到我國旅遊，同時進行健康檢查或是接受美容手術等。有關國際醫療的相關倫理法律議題，下列敘述何者正確？
A. 外國人在我國不能上法院告醫師
B. 提供外國人的醫療行為就不受醫療法的管理
C. 提供自費的醫療行為就不受醫療法的管理
D. 對待病人的醫學倫理應該不分種族、國籍、黨派

正確答案：D. 對待病人的醫學倫理應該不分種族、國籍、黨派